Clinical trial inclusion criterion:
Subjects were to be non-users of tobacco products (minimum of 6 months prior to the start of the study).

Annotated entities:
- Condition: "users of tobacco products"
- Negation: "non"
- Temporal: "minimum of 6 months prior to the start of the study"
- Reference_point: "the start of the study"